一氧化碳中毒病人可能會出現那些變化？①體循環動脈血氧飽和度（arterial hemoglobin oxygen  saturation）下降 ②血液中乳酸（lactic acid）上升 ③體循環血液總含氧量（oxygen content of systemic arterial blood）下降 ④氧氣與血紅素解離曲線（oxygen-hemoglobin dissociation curve）往右移
A. ①③④
B. ①②③
C. 僅①③
D. 僅③④

正確答案：B. ①②③